Clinical trial exclusion criteria:
Use of any investigational or non-registered drug or vaccine product within 30 days preceding the administration of the study vaccine or planned use within the first six weeks of the study period
Has received any licensed or other investigational influenza vaccine within 3 months prior to enrollment in this study or expected receipt of any influenza vaccination before the Day 21 blood collection
History of excessive alcohol use, drug abuse or significant psychiatric illness
Tobacco use within 3 months of enrollment and throughout first 6 months of the study
Has a chronic illness (e.g., liver or kidney disease), receiving a concomitant therapy or have any other condition that could interfere with the subject's participation in the study or in the interpretation of the study results
Clinically significant abnormal liver function tests at screening
Positive serology for HBsAg, HCV or HIV antibodies
Pregnant or lactating female
Having cancer or have received treatment for cancer within three years (persons with a history of cancer who are disease-free without treatment for three years or more are eligible), excluding minor skin cancers, which are allowed unless located at the vaccination site
Persons with impaired immune responsiveness (of any cause), including diabetes mellitus and autoimmune disorders
Persons presently receiving or having a recent history of receiving (within the past six months) any medication or therapeutic modality that affects the immune system such as allergy shots, immune globulin, interferon, immunomodulators, radiation therapy, cytotoxic drugs or drugs known to be frequently associated with significant major organ toxicity, or systemic corticosteroids (oral or injectable). Inhaled and topical corticosteroids are allowed.
Persons with a history of severe allergic reaction after previous vaccinations or hypersensitivity to any seasonal influenza vaccine component
Persons with a history of Guillain-Barré Syndrome
Receipt of blood or blood products 8 weeks prior to vaccination or planned administration during the three week study period following vaccination
Donation of blood or blood products within 8 weeks prior to vaccination or during the three week study period following
An oral temperature >100.4° or acute disease within 72 hours prior to vaccination, defined as the presence of a moderate or severe illness (as determined by the investigator through medical history and physical examination; for example, those requiring an absence from work) with or without fever.
Body Mass Index >29.9
Any disorder of coagulation
A clinical diagnosis of influenza within the previous 12 months
Any other condition or circumstance which, in the opinion of the Principal Investigator, poses an unacceptable risk for participation in the study

Annotated entities:
- Drug: "drug"
- Drug: "vaccine product"
- Qualifier: "investigational"
- Qualifier: "non-registered"
- Temporal: "within 30 days preceding the administration of the study vaccine"
- Reference_point: "the administration of the study vaccine"
- Non-query-able: "planned use"
- Temporal: "within the first six weeks of the study period"
- Mood: "planned use"
- Reference_point: "the study period"
- Context_Error: "Use of any investigational or non-registered drug or vaccine product within 30 days preceding the administration of the study vaccine or planned use within the first six weeks of the study period"
- Drug: "influenza vaccine"
- Qualifier: "licensed"
- Qualifier: "other investigational"
- Temporal: "within 3 months prior to enrollment in this study"
- Reference_point: "enrollment in this study"
- Observation: "expected receipt"
- Non-query-able: "expected receipt"
- Drug: "any influenza vaccination"
- Temporal: "before the Day 21"
- Reference_point: "Day 21"
- Temporal: "History"
- Condition: "excessive alcohol use"
- Condition: "drug abuse"
- Condition: "psychiatric illness"
- Undefined_semantics: "psychiatric illness"
- Qualifier: "significant"
- Condition: "Tobacco use"
- Temporal: "within 3 months of enrollment"
- Reference_point: "enrollment"
- Temporal: "throughout first 6 months of the study"
- Reference_point: "the study"
- Condition: "chronic illness"
- Undefined_semantics: "chronic illness"
- Condition: "liver disease"
- Condition: "kidney disease"
- Procedure: "therapy"
- Temporal: "concomitant"
- Undefined_semantics: "therapy"
- Condition: "any other condition"
- Qualifier: "could interfere with the subject's participation in the study"
- Measurement: "liver function tests"
- Value: "abnormal"
- Qualifier: "Clinically significant"
- Subjective_judgement: "Clinically significant"
- Temporal: "at screening"
- Reference_point: "screening"
- Measurement: "HBsAg antibodies"
- Measurement: "HCV antibodies"
- Measurement: "HIV antibodies"
- Value: "Positive"
- Condition: "Pregnant"
- Condition: "lactating"
- Person: "female"
- Condition: "cancer"
- Condition: "cancer"
- Procedure: "treatment for cancer"
- Temporal: "within three years"
- Condition: "cancer"
- Temporal: "history"
- Condition: "disease-free"
- Procedure: "treatment"
- Negation: "without"
- Temporal: "for three years or more"
- Grammar_Error: "are eligible"
- Condition: "impaired immune responsiveness"
- Condition: "diabetes mellitus"
- Condition: "autoimmune disorders"
- Temporal: "within the past six months"
- Drug: "any medication"
- Procedure: "therapeutic modality"
- Qualifier: "affects the immune system"
- Drug: "allergy shots"
- Drug: "immune globulin"
- Drug: "interferon"
- Drug: "immunomodulators"
- Procedure: "radiation therapy"
- Drug: "cytotoxic drugs"
- Drug: "drugs known to be frequently associated with significant major organ toxicity"
- Qualifier: "known to be frequently associated with significant major organ toxicity"
- Drug: "systemic corticosteroids"
- Qualifier: "oral"
- Qualifier: "injectable"
- Grammar_Error: "Inhaled and topical corticosteroids are allowed."
- Condition: "allergic reaction"
- Qualifier: "severe"
- Temporal: "history"
- Temporal: "after previous vaccinations"
- Reference_point: "previous vaccinations"
- Condition: "hypersensitivity to any seasonal influenza vaccine component"
- Drug: "seasonal influenza vaccine component"
- Condition: "Guillain-Barré Syndrome"
- Procedure: "Receipt of blood"
- Procedure: "Receipt of blood products"
- Temporal: "8 weeks prior to vaccination"
- Reference_point: "vaccination"
- Temporal: "during the three week study period following vaccination"
- Reference_point: "three week study period following vaccination"
- Mood: "planned administration"
- Procedure: "Donation of blood"
- Procedure: "Donation of blood products"
- Temporal: "within 8 weeks prior to vaccination"
- Reference_point: "vaccination"
- Temporal: "during the three week study period"
- Reference_point: "the three week study period"
- Measurement: "oral temperature"
- Value: ">100.4°"
- Condition: "acute disease"
- Temporal: "within 72 hours prior to vaccination"
- Reference_point: "vaccination"
- Condition: "moderate illness"
- Condition: "severe illness"
- Measurement: "Body Mass Index"
- Value: ">29.9"
- Condition: "disorder of coagulation"
- Condition: "influenza"
- Temporal: "within the previous 12 months"
- Subjective_judgement: "Any other condition or circumstance which, in the opinion of the Principal Investigator, poses an unacceptable risk for participation in the study"
- Context_Error: "Any other condition or circumstance which, in the opinion of the Principal Investigator, poses an unacceptable risk for participation in the study"
- Post-eligibility: "Any other condition or circumstance which, in the opinion of the Principal Investigator, poses an unacceptable risk for participation in the study"